Clinical trial exclusion criterion:
1. History of penetrating brain injury

Entity relations:
- Has_temporal("penetrating brain injury", "History")